no previous treatment

The above is a clinical trial inclusion criterion. Annotated with entity spans:
[Context_Error: no previous treatment]